Clinical trial inclusion criterion:
Agree to be washed-out for two weeks if receiving SSRI, SNRI or NASA.

Entity relations:
- Has_temporal("washed-out", "for two weeks")
- OR("SSRI", "SNRI", "NASA")